Clinical trial exclusion criterion:
age less than 18 years

Annotated entities:
- Person: "age"
- Value: "less than 18 years"